Willing to undergo to serological testing to HIV, HBV and HCV;

The above is a clinical trial inclusion criterion. Annotated with entity spans:
[Non-query-able: Willing to undergo to serological testing to HIV, HBV and HCV;]